De un tejido al que se le añade oligomicina, cabe esperar que:
1. Consuma oxígeno y produzca ATP.
2. No consuma oxígeno y produzca ATP.
3. Consuma oxígeno y no produzca ATP.
4. Se incremente la producción de ATP.
5. Ni consuma oxígeno ni produzca ATP.

Respuesta correcta: 5. Ni consuma oxígeno ni produzca ATP.